End stage renal disease (CrCl < 15 ml/min)

The above is a clinical trial exclusion criterion. Annotated with entity spans:
[Condition: End stage renal disease] ([Measurement: CrCl] [Value: < 15 ml/min])